La pérdida de 3 genes de la cadena alfa de globina es la principal causa de:
1. Hidropesía fetal.
2. Rasgo alfa-talasémico.
3. Enfermedad de Cooley.
4. Enfermedad por hemoglobina H.
5. Alfa-talasemia silente.

Respuesta correcta: 4. Enfermedad por hemoglobina H.